What molecule is targeted by Avelumab?

Avelumab is a monoclonal antibody that binds programmed death-ligand 1 (PD-L1).